Clinical trial inclusion criterion:
Intention to perform primary percutaneous coronary intervention;

Entity relations:
- Has_mood("percutaneous coronary intervention", "Intention to perform")
- Has_qualifier("percutaneous coronary intervention", "primary")